Significant illness, trauma or surgical procedures.

The above is a clinical trial exclusion criterion. Annotated with entity spans:
[Qualifier: Significant] [Condition: illness], [Condition: trauma] or [Procedure: surgical procedures].